已婚的陳先生與妻子分居多年，他因為隱球菌性腦膜炎住院，而後被診斷為愛滋病，陳先生再三交代院方醫護人員，不要告訴他的任何家人，所有他的醫療決策都委由一位王姓男性友人做主並已立下委任書。現在，他突然昏迷，需要緊急插管並轉到加護病房，醫師想要討論有關病人之DNR事宜，應該找誰？
A. 他的男性友人王先生
B. 陳太太
C. 陳先生的父母親
D. 陳先生的成年長子

正確答案：A. 他的男性友人王先生